Female patients who are lactating and breastfeeding or pregnant

The above is a clinical trial exclusion criterion. Annotated with entity spans:
[Pregnancy_considerations: Female patients who are lactating and breastfeeding or pregnant]